Absence of informed consent

The above is a clinical trial exclusion criterion. Annotated with entity spans:
[Informed_consent: Absence of informed consent]